Respecto de la Anorexia Nerviosa cabe afirmar que:
1. Aunque se consiga estabilizar el peso, las pacientes siguen presentando una psicopatología considerable.
2. La tasa de suicidio es del 15%.
3. Los síntomas comorbidos más frecuentes son los obsesivos.
4. Los/as purgantes presentan menos gravedad psicopatológicas que los/as restrictivas.
5. El tratamiento psicofarmacológico de elección es el tratamiento farmacológico por sí solo.

Respuesta correcta: 1. Aunque se consiga estabilizar el peso, las pacientes siguen presentando una psicopatología considerable.